Indique la respuesta correcta en cuanto a la administración de medicación mediante inhalación, los inhaladores presurizados:
1. Se emplean, casi exclusivamente, en pacientes con vía respiratoria natural mediante efecto Venturi.
2. Proporcionan una cantidad precisa de medicación, pero su uso es complicado en pacientes con vía respiratoria natural, ya que precisa sincronización de la inspiración.
3. Se emplean en pacientes con vía respiratoria natural. No precisan sincronización pero requieren un alto flujo inspiratorio.
4. Utilizan un cuarzo piezoeléctrico que impone vibraciones de alta frecuencia a la solución aerolizada.

Respuesta correcta: 2. Proporcionan una cantidad precisa de medicación, pero su uso es complicado en pacientes con vía respiratoria natural, ya que precisa sincronización de la inspiración.